Clinical trial inclusion criterion:
Females must have a urine or serum pregnancy test (Human Chorionic Gonadotropin) that is negative at Screening and Day 1

Entity relations:
- Has_value("urine pregnancy test", "negative")
- Has_temporal("urine pregnancy test", "at Screening")
- Has_value("Human Chorionic Gonadotropin", "negative")
- AND("at Screening", "Day 1")
- OR("urine pregnancy test", "serum pregnancy test")